El índice eudísmico es un parámetro con interés farmacológico que expresa la relación entre:
1. Dos fármacos diasterómeros.
2. Dos fármacos bioisósteros.
3. Dos enantiómeros.
4. Un fármaco y un profármaco, análogo estructural.
5. Dos modificaciones estructurales, una hidrofílica y otra lipofílica, de un determinado fármaco.

Respuesta correcta: 3. Dos enantiómeros.